一位 35 歲女性至精神科門診就醫，主要困擾為她最近二個月每次和公司新客戶碰面時，就會感到突發性的緊繃、冒汗、心跳加速，擔心自己說錯話，得罪客戶。此種現象愈來愈嚴重，甚至令其想要辭職。下列何者為該病患最可能之臨床診斷？
A. 強迫症（obsessive compulsive disorder）
B. 社交畏懼症（social phobia）
C. 廣泛性焦慮症（generalized anxiety disorder）
D. 恐慌症（panic disorder）

正確答案：B. 社交畏懼症（social phobia）